Clinical trial exclusion criterion:
Current treatment with drugs interfering with CYP3A4 metabolism (to avoid interaction with ticagrelor): Ketoconazole, itraconazole, voriconazole, clarithromycin, nefazodone, ritonavir, saquinavir, nelfinavir, indinavir, atazanavir, and telithromizycin.

Entity relations:
- AND("drugs", "CYP3A4 metabolism")
- Has_mood("CYP3A4 metabolism", "interfering with")
- Subsumes("drugs", "Ketoconazole")
- OR("Ketoconazole", "itraconazole", "voriconazole", "clarithromycin", "nefazodone", "ritonavir", "saquinavir", "nelfinavir", "indinavir", "atazanavir", "telithromizycin")